La escala de Braden se utiliza en las primeras 24 horas de ingreso del paciente para evaluar el riesgo de ulceras por presión. Teniendo en cuenta esto, señale qué puntuación tendría una persona que tiene alto riesgo de sufrir ulceras por presión:
1. Mayor de 13.
2. Trece.
3. Menor de 13.
4. Mayor de 15.

Respuesta correcta: 3. Menor de 13.